Clinical trial exclusion criterion:
Patients with hepatic artery chemoembolization within the last 6 months (one month if there are other sites of measurable disease)

Entity relations:
- Has_context("one month", "other sites of measurable disease")
- Has_temporal("hepatic artery chemoembolization", "within the last 6 months")
- OR("within the last 6 months", "one month")